Señale la respuesta correcta en relación con la monitorización de las concentraciones plasmáticas de fármacos:
1. Las reacciones de alergia están relacionadas con la dosis administrada.
2. La extracción de la muestra de sangre debe realizarse una vez alcanzado el equilibrio de distribución del fármaco en el organismo.
3. La información proporcionada por la determinación analítica de la concentración plasmática es suficiente para realizar la individualización posológica.
4. Únicamente los métodos de inmunoensayo son válidos para realizar la determinación analítica de las muestras de sangre.
5. Se debe realizar para todos los fármacos que se administran por vía intravenosa.

Respuesta correcta: 2. La extracción de la muestra de sangre debe realizarse una vez alcanzado el equilibrio de distribución del fármaco en el organismo.